Clinical trial exclusion criterion:
Morbid obesity (BMI> 40 kg / m2).

Annotated entities:
- Condition: "Morbid obesity"
- Measurement: "BMI"
- Value: "> 40 kg / m2"